Clinical trial inclusion criterion:
Age 18 to 55 years old (inclusive) as of the date the ICF is signed

Entity relations:
- Has_value("Age", "18 to 55 years old (")